Which is the role of the IFIT1 gene in Systemic Lupus Erythematosus (SLE)?

The IFIT1 gene, originally identified as a telomere-binding factor in yeast, is now recognized to play a critical role in the pathogenesis of Systemic Lupus Erythematosus (SLE) disease. IFit1 overexpression generates an inflammatory response via activation of transcriptional mediator NF-kappaB and leads to activation of the nuclear factor κB signaling pathway, with consequent inhibition of IκB kinase and nuclear factor-κB activation.